中風病人最常見的排尿障礙為何？
A. 膀胱無收縮力
B. 膀胱頸功能阻塞
C. 尿道外括約肌共濟失調
D. 逼尿肌反射亢進

正確答案：D. 逼尿肌反射亢進